Patients with severe emphysema, pulmonary vasculitis, or a history of pulmonary emboli.

The above is a clinical trial exclusion criterion. Annotated with entity spans:
Patients with [Qualifier: severe] [Condition: emphysema], [Condition: pulmonary vasculitis], or a history of [Condition: pulmonary emboli].